一位 50 歲女性，使用黑色染髮劑三天後，引起頭皮與臉部劇癢與浮腫，下列何種是貼膚試驗最需檢測的成分？
A. Nickel sulfate
B. Mercury salt
C. Procaine
D. Para-phenylendiamine

正確答案：D. Para-phenylendiamine